Clinical trial exclusion criterion:
Having significant medical illnesses that would interfere with the conduct of the study

Annotated entities:
- Non-query-able: "Having significant medical illnesses that would interfere with the conduct of the study"